Clinical trial exclusion criterion:
Evolutive skin disease on the testing zone (lower back).

Entity relations:
- Subsumes("testing zone", "lower back")
- Has_qualifier("Evolutive skin disease", "testing zone")